A diferencia de la inteligencia cristalizada ¿Cuál de las siguientes características presenta la inteligencia fluida?
1. Sus puntuaciones dependen mucho del diseño del estudio, siendo más optimistas en estudios con diseños transversales.
2. Implica conocimientos sensibles al contexto cultural.
3. Presenta puntuaciones que suelen incrementarse en la adultez media y vejez.
4. Alcanza su nivel máximo en la adultez temprana y luego sus puntuaciones suelen decrecer.

Respuesta correcta: 4. Alcanza su nivel máximo en la adultez temprana y luego sus puntuaciones suelen decrecer.